Which two surgical methods were compared in the RAZOR trial?

The RAZOR trial compared open radical cystectomy vs. robot-assisted radical cystectomy in patients with bladder cancer.